Clinical trial inclusion criterion:
Progesterone (P4) serum level at the HCG triggering day <= 1.5 ng/mL (Day O/Randomization)

Annotated entities:
- Measurement: "Progesterone (P4) serum level"
- Temporal: "at the HCG triggering day"
- Reference_point: "the HCG triggering day"
- Value: "<= 1.5 ng/mL"
- Reference_point: "Day O/Randomization"